Clinical trial inclusion criteria:
Patient is currently enrolled in a Novartis OGD or GMA-sponsored or Incyte-sponsored clinical study (where Incyte can delegate the sponsorship to a preferred CRO, if applicable) that is approved to enroll into this rollover study, is receiving ruxolitinib and has fulfilled all of the requirements of the parent protocol.
Patient is currently benefiting from the treatment with ruxolitinib, as determined by the investigator
Patient has demonstrated compliance, as assessed by the investigator, with the parent study protocol requirements Willingness and ability to comply with scheduled visits, treatment plans and any other study procedures
Patient currently has no evidence of progressive disease, as determined by the investigator, following previous treatment with ruxolitinib
Written informed consent obtained prior to enrolling in roll-over study and receiving study medication. If consent cannot be expressed in writing, it must be formally documented and witnessed, ideally via an independent trusted witness.

Annotated entities:
- Competing_trial: "Patient is currently enrolled in a Novartis OGD or GMA-sponsored or Incyte-sponsored clinical study (where Incyte can delegate the sponsorship to a preferred CRO, if applicable) that is approved to enroll into this rollover study, is receiving ruxolitinib and has fulfilled all of the requirements of the parent protocol."
- Drug: "ruxolitinib"
- Non-query-able: "Patient is currently benefiting from the treatment with ruxolitinib, as determined by the investigator"
- Post-eligibility: "Patient has demonstrated compliance, as assessed by the investigator, with the parent study protocol requirements Willingness and ability to comply with scheduled visits, treatment plans and any other study procedures"
- Condition: "progressive disease"
- Drug: "ruxolitinib"
- Informed_consent: "Written informed consent obtained prior to enrolling in roll-over study and receiving study medication. If consent cannot be expressed in writing, it must be formally documented and witnessed, ideally via an independent trusted witness"